Clinical trial inclusion criterion:
patients aged >18, <75, left ventricle ejection fraction (LVEF) >50%, multivessel coronary disease detected by coronarography, indication to receive a CABG, stable CAD. All diabetics and non diabetics.

Entity relations:
- Has_value("aged", ">18, <75")
- Subsumes("left ventricle ejection fraction", "LVEF")
- Has_value("left ventricle ejection fraction", ">50%")
- Has_mood("CABG", "indication to receive")
- AND("coronarography", "multivessel coronary disease")
- Has_qualifier("CAD", "stable")
- OR("aged", "left ventricle ejection fraction", "coronarography", "CABG", "CAD", "diabetics", "non diabetics")